Known history of/suspected malignant neoplasm of various sites.

The above is a clinical trial exclusion criterion. Annotated with entity spans:
Known [Temporal: history of]/[Mood: suspected] [Condition: malignant neoplasm] of [Qualifier: various sites].